Clinical trial inclusion criterion:
If the patient is a woman of child-bearing potential, she must agree to use an acceptable form of birth control for duration of study participation.

Annotated entities:
- Pregnancy_considerations: "If the patient is a woman of child-bearing potential, she must agree to use an acceptable form of birth control for duration of study participation"